¿Cuáles son los tres tipos de células óseas?
1. Trabéculas, mitocondrias y osteocitos.
2. Osteoclastos, trabéculas y osteolitos.
3. Osteocitos, osteoblastos y mitocondrias.
4. Trabéculas, mitocondrias y osteocitos.
5. Osteoblastos, osteoclastos y osteocitos.

Respuesta correcta: 5. Osteoblastos, osteoclastos y osteocitos.